Clinical trial exclusion criterion:
2. Screening tool: TMS adult safety screening, Medical History.

Entity relations:
- AND("Screening", "TMS adult safety screening")
- Has_temporal("Screening", "Medical History")